下列那一型肌肉受刺激之後，由刺激至達到最大收縮力所需之時間（即 contraction time）最長？
A. 心室肌（cardiac ventricular muscle）
B. 小腸平滑肌（small intestinal smooth muscle）
C. 腓腸肌（gastrocnemius）
D. 控制眼球運動之肌肉

正確答案：B. 小腸平滑肌（small intestinal smooth muscle）